Clinical trial exclusion criterion:
Hematologic malignancies.

Annotated entities:
- Condition: "Hematologic malignancies"